Patients with right-to-left, bi-directional, or transient right-to-left cardiac shunts

The above is a clinical trial exclusion criterion. Annotated with entity spans:
Patients with [Qualifier: right-to-left,] [Qualifier: bi-directional], or [Qualifier: transient] [Qualifier: right-to-left] [Condition: cardiac shunts]